Clinical trial exclusion criterion:
under 18 or over 50 years of age

Entity relations:
- Has_value("age", "under 18 or over 50 years")